Clinical trial exclusion criterion:
History of malignant tumor or life expectancy under 12 months.

Annotated entities:
- Condition: "malignant tumor"
- Person: "life expectancy"
- Value: "under 12 months"